El miedo a los extraños suele aparecer:
1. Alrededor de los 3 meses.
2. Es innato.
3. En el último subestadio sensoriomotor.
4. Alrededor de los 7-9 meses.

Respuesta correcta: 4. Alrededor de los 7-9 meses.